對於壓力差為 60 mmHg 之肺動脈瓣狹窄的病患，最適當的處理方式是：
A. 持續觀察即可
B. 長期口服毛地黃
C. 施行氣球肺動脈瓣膜成形術（balloon pulmonary valvuloplasty）
D. 施行肺動脈瓣膜置換術（pulmonary valvular replacement）

正確答案：C. 施行氣球肺動脈瓣膜成形術（balloon pulmonary valvuloplasty）